30 歲的小明因心情不好，喝了兩口巴拉刈（Paraquat）農藥，下列敘述何者錯誤？
A. 通常會在數分鐘內昏迷
B. 肺纖維化（pulmonary fibrosis）通常是主要致死原因
C. 巴拉刈可經由皮膚吸收，故應除去受污染的衣物
D. 可重複使用活性碳或陶土（Fuller's earth），可減少 Paraquat 吸收

正確答案：A. 通常會在數分鐘內昏迷